Patient with a history of, or presenting a new episode of atrial fibrillation (either permanent or paroxysmal).

The above is a clinical trial inclusion criterion. Annotated with entity spans:
Patient with a history of, or presenting a [Qualifier: new episode] of [Condition: atrial fibrillation] (either permanent or paroxysmal).